有關白三烯素接受器拮抗劑（leukotriene receptor antagonist）之敘述，下列何者正確？
A. 在氣喘控制方面，效果比吸入型類固醇為佳
B. 在氣喘控制方面，效果比吸入型長效乙二型交感神經刺激劑（inhaled long-acting β2-agonist）為佳
C. 為成人氣喘控制藥物之首要選擇
D. 為口服藥物，常用劑量為一天使用一次

正確答案：D. 為口服藥物，常用劑量為一天使用一次